Con respecto a los conocidos como exaltadores de solubilidad en medicamentos biotecnológicos podemos decir:
1. Que no son necesarios dada la buena solubilidad de los principios activos.
2. Que sí son necesarios dada la baja solubilidad de los excipientes.
3. Que no son necesarios en las proteínas, especialmente en las no glicosiladas.
4. Con frecuencia se recurre al uso de la lisina o arginina como tales exaltadores.
5. Ninguna de las anteriores.

Respuesta correcta: 4. Con frecuencia se recurre al uso de la lisina o arginina como tales exaltadores.